12. Evidence of active infection requiring intravenous or oral antibiotics within 4 weeks of Screening.

The above is a clinical trial exclusion criterion. Annotated with entity spans:
[Parsing_Error: 12.] Evidence of active [Condition: infection requiring] intravenous or oral antibiotics [Temporal: within 4 weeks of Screening].